Clinical trial exclusion criteria:
1. History of colorectal surgery
2. Suspected or known digestive tract obstruction, stricture, or perforation
3. Serious status of illness, such as severe renal failure whose creatinine clearance<30 ml/min, New York Heart Association grade III or grade IV congestive heart failure, or hemodynamic instability, etc.
4. Incapable of completing bowel preparation，such as dysphagia, allergy to purgatives, or impaired mental status, etc.
5. Pregnancy or breastfeeding
6. Incomplete colonoscopy due to causes except poor bowel preparation
7. Unable to give informed consent
8. Have participated in the study before.

Annotated entities:
- Procedure: "colorectal surgery"
- Temporal: "History"
- Parsing_Error: "1."
- Condition: "digestive tract obstruction"
- Condition: "digestive tract stricture"
- Condition: "digestive tract perforation"
- Parsing_Error: "2."
- Parsing_Error: "3."
- Condition: "renal failure"
- Measurement: "creatinine clearance"
- Value: "<30 ml/min"
- Qualifier: "severe"
- Measurement: "New York Heart Association"
- Value: "grade III or grade IV"
- Condition: "congestive heart failure"
- Condition: "hemodynamic instability"
- Undefined_semantics: "Serious status of illness"
- Subjective_judgement: "Serious status of illness"
- Condition: "Serious status of illness"
- Parsing_Error: "4."
- Condition: "Incapable of completing bowel preparation"
- Condition: "dysphagia"
- Condition: "allergy"
- Drug: "purgatives"
- Condition: "impaired mental status"
- Parsing_Error: "5."
- Condition: "Pregnancy"
- Observation: "breastfeeding"
- Parsing_Error: "6."
- Procedure: "colonoscopy"
- Condition: "poor bowel preparation"
- Negation: "except"
- Qualifier: "Incomplete"
- Parsing_Error: "7."
- Observation: "informed consent"
- Parsing_Error: "8."